With which complexes is the protein SUS1 associated?

Sus1/ENY2 is a component of the SAGA and TREX-2 complexes